Clinical trial exclusion criterion:
Known secondary causes (genetic, endocrine, or metabolic) for obesity (eg, Prader-Willi syndrome, Bardet Biedl syndrome, Down's Syndrome, untreated hypothyroidism, Cushing's syndrome, daily systemic corticosteroid exposure for longer than 30 days, history of significant exposure to corticosteroids for chronic illness during the past year; inhaled steroids will be allowed)

Annotated entities:
- Condition: "secondary causes for obesity"
- Qualifier: "genetic"
- Qualifier: "endocrine"
- Qualifier: "metabolic"
- Condition: "Prader-Willi syndrome"
- Condition: "Bardet Biedl syndrome"
- Condition: "Down's Syndrome"
- Condition: "untreated hypothyroidism"
- Condition: "Cushing's syndrome"
- Multiplier: "daily"
- Drug: "systemic corticosteroid"
- Temporal: "for longer than 30 days"
- Temporal: "history"
- Qualifier: "significant exposure"
- Drug: "corticosteroids"
- Condition: "chronic illness"
- Temporal: "during the past year"
- Non-representable: "inhaled steroids will be allowed"